Clinical trial inclusion criterion:
3. Residence in AFRH-Washington or the Veterans Home of California-Yountville

Annotated entities:
- Visit: "AFRH-Washington"
- Visit: "Veterans Home of California-Yountville"
- Observation: "Residence"